on going neoplastic history with a short prognosis,

The above is a clinical trial exclusion criterion. Annotated with entity spans:
[Temporal: on going] [Condition: neoplastic] [Temporal: history] with a [Value: short] [Measurement: prognosis],